Para planificar sesiones de exposición efectivas en un caso de fobia específica a un animal, hay que tener en cuenta que el ritmo de la exposición (también llamado gradiente de exposición):
1. No afecta a la eficacia de la técnica y dependerá de las preferencias del paciente.
2. Afecta a la eficacia, siendo más eficaz la exposición gradual.
3. Afecta a la eficacia, siendo más eficaz la exposición gradual simbólica.
4. Afecta a la eficacia, siendo más eficaz la exposición masiva.

Respuesta correcta: 1. No afecta a la eficacia de la técnica y dependerá de las preferencias del paciente.